Clinical trial exclusion criterion:
Clinically significant pulmonary disease.

Entity relations:
- Has_qualifier("pulmonary disease", "Clinically significant")